Clinical trial exclusion criterion:
Suffering from a movement disorder that could mimic or confound the accurate diagnosis of RLS (eg, Tourette's syndrome, tic disorder, periodic limb movement disorder [PLMD], sleep disorders).

Annotated entities:
- Condition: "movement disorder"
- Condition: "Tourette's syndrome"
- Condition: "tic disorder"
- Condition: "periodic limb movement disorder"
- Condition: "PLMD"
- Condition: "sleep disorders"